一位 24 歲平常健康之男性病人，突發高燒、咳嗽 3 天、胸部 X 光呈現右上肺葉 segmental consolidation，則最可能之病原菌為：
A. Hemophilus influenzae
B. Streptococcus pneumoniae
C. Pseudomonas aeruginosa
D. Chlamydia pneumoniae

正確答案：B. Streptococcus pneumoniae